En cromatografía líquida de alta resolución a una determinada velocidad de flujo, la eficiencia de la columna cromatográfica:
1. Aumenta al aumentar el tamaño de partícula.
2. Aumenta al disminuir el tamaño de la partícula.
3. La eficiencia no depende del tamaño de la partícula.
4. La eficiencia depende de las características del detector utilizado.

Respuesta correcta: 2. Aumenta al disminuir el tamaño de la partícula.